Has any systemic inflammatory condition, including psoriatic arthritis, active Lyme disease, systemic lupus erythematosus, infectious arthritis, vasculitis, parvovirus infection, rheumatoid arthritis, active uveitis, or active IBD

The above is a clinical trial exclusion criterion. Annotated with entity spans:
Has any systemic [Condition: inflammatory condition], including [Condition: psoriatic arthritis], [Qualifier: active] [Condition: Lyme disease], [Condition: systemic lupus erythematosus], [Condition: infectious arthritis], [Condition: vasculitis], [Condition: parvovirus infection], [Condition: rheumatoid arthritis], [Condition: active uveitis], or [Condition: active IBD]